Clinical trial inclusion criterion:
Body mass index (BMI) = 27 Kg/m2 and/or waist circumference = 102 cm (40 inches) in men and 88 cm (35 inches) in women, respectively.

Annotated entities:
- Measurement: "Body mass index (BMI)"
- Value: "= 27 Kg/m2"
- Measurement: "waist circumference"
- Value: "= 102 cm"
- Value: "40 inches"
- Person: "men"
- Value: "88 cm"
- Value: "35 inches"
- Person: "women"